Clinical trial exclusion criterion:
Mental disorders preventing the subject to understand the project description.

Annotated entities:
- Condition: "Mental disorders"
- Qualifier: "preventing the subject to understand the project description"